has a negative pregnancy test on the day of vaccination and

The above is a clinical trial inclusion criterion. Annotated with entity spans:
has a [Value: negative] [Measurement: pregnancy test] [Temporal: on the day of vaccination] and